Clinical trial exclusion criterion:
Signs or symptoms suspicious for Primary HIV Infection (PHI).

Entity relations:
- Subsumes("Primary HIV Infection", "PHI")
- AND("Signs", "Primary HIV Infection")
- OR("Signs", "symptoms")